Clinical trial exclusion criterion:
Serious and unstable medical illnesses including cardiovascular disease and cancer.

Entity relations:
- Has_qualifier("medical illnesses", "Serious")
- AND("medical illnesses", "cardiovascular disease")
- Has_qualifier("medical illnesses", "unstable")
- OR("cardiovascular disease", "cancer")